根據2013年美國婦產科醫學會（ACOG）的建議，將胎心音監測準則依嚴重程度分為三級，下列何者不是第三級胎心音（category III）異常？
A. 早發性心搏減速（early variable deceleration）及心搏間變異消失（absent baseline fetal heart rate
B. 反覆的變異性心搏減速（recurrent variable deceleration）及心搏間變異消失（absent baseline fetal heart
C. 反覆的遲發性心搏減速（recurrent late deceleration）及心搏間變異消失（absent baseline fetal heart rate
D. 正弦曲線胎心率（sinusoidal fetal heart rate）

正確答案：A. 早發性心搏減速（early variable deceleration）及心搏間變異消失（absent baseline fetal heart rate